下列何種 NSAIDs 藥物，最容易引起血栓的副作用？
A. diclofenac
B. ibuprofen
C. rofecoxib
D. sulindac

正確答案：C. rofecoxib